Clinical trial inclusion criterion:
Both genders;

Annotated entities:
- Person: "genders"